Clinical trial inclusion criterion:
2. Has provided verbal and written informed consent.

Annotated entities:
- Parsing_Error: "2."
- Post-eligibility: "Has provided verbal and written informed consent."
- Non-query-able: "Has provided verbal and written informed consent."